La denominación oficial española (DOE) con la que se conoce a cada principio activo destinado a la fabricación de un medicamento, es otorgada por:
1. La Dirección General de Farmacia y Productos sanitarios.
2. La Agencia Española de Medicamentos y Productos Sanitarios.
3. La Organización Mundial de la Salud.
4. La Agencia Europea del Medicamento.

Respuesta correcta: 2. La Agencia Española de Medicamentos y Productos Sanitarios.